Clinically significant valvular heart disease

The above is a clinical trial exclusion criterion. Annotated with entity spans:
Clinically significant [Condition: valvular heart disease]